Clinical trial exclusion criteria:
Clinical diagnosis of hepatic or renal disease
Clinical diagnosis of chronic or acute alcoholism
History of allergy or hypersensitivity to Sugammadex and/or atropine or Neostigmine
Current medications with CNS effects
History of neurologic disease
Diaphragmatic palsy
Pregnancy or nursing
History of malignant arrhythmias

Annotated entities:
- Condition: "renal disease"
- Condition: "hepatic disease"
- Qualifier: "Clinical diagnosis"
- Qualifier: "Clinical diagnosis"
- Qualifier: "acute"
- Qualifier: "chronic"
- Condition: "alcoholism"
- Condition: "allergy"
- Condition: "hypersensitivity"
- Drug: "Sugammadex"
- Drug: "atropine"
- Drug: "Neostigmine"
- Temporal: "History"
- Condition: "CNS effects"
- Drug: "medications"
- Condition: "neurologic disease"
- Temporal: "History"
- Condition: "Diaphragmatic palsy"
- Condition: "Pregnancy"
- Condition: "nursing"
- Temporal: "History"
- Condition: "malignant arrhythmias"